下列何種人體寄生蟲感染較常導致臨床上出現嚴重貧血症狀？
A. 日本血吸蟲（Schistosoma japonicum）
B. 班氏絲蟲（Wuchereria bancrofti）
C. 十二指腸鉤蟲（Ancylostoma duodenale）
D. 廣東住血線蟲（Angiostrongylus cantonensis）

正確答案：C. 十二指腸鉤蟲（Ancylostoma duodenale）